Clinical trial exclusion criterion:
patient not previously scheduled for radiofrequency ablation of the cervical, thoracic, or lumbar facets, or sacroiliac joints

Entity relations:
- Has_mood("radiofrequency ablation", "scheduled for")
- Has_temporal("radiofrequency ablation", "previously")
- Has_negation("radiofrequency ablation", "not")
- Has_qualifier("radiofrequency ablation", "cervical facets")
- OR("cervical facets", "thoracic facets", "sacroiliac joints", "lumbar facets")